Clinical trial exclusion criterion:
Patient previously treated with biologics.

Annotated entities:
- Drug: "biologics"
- Undefined_semantics: "biologics"
- Temporal: "previously"
- Procedure: "treated"